一位 27 歲男性，因為三個月的乾咳與胸悶到院求診。胸部 X 光顯示為兩側肺門腫塊。胸部電腦斷層顯示為兩側肺門與縱膈腔淋巴腺腫。淋巴結活體切片病理顯示為非乳酪狀壞死之肉芽腫。有關後續診斷與治療的敘述何者正確？
A. 有 2/3 的病例血中 Angiotensin converting enzyme（ACE）會升高
B. Ga67 scan可以提供此病的確診影像，為必要之檢查
C. 應給予高劑量類固醇治療
D. 應給予抗結核藥物治療

正確答案：A. 有 2/3 的病例血中 Angiotensin converting enzyme（ACE）會升高